Mechanical tricuspid heart valve

The above is a clinical trial exclusion criterion. Annotated with entity spans:
[Device: Mechanical tricuspid heart valve]